Schiller-Duvall bodies 通常在下列何種生殖細胞腫瘤（germ-cell tumor）中發現？
A. 惡性胚胎瘤（dysgerminoma）
B. 絨毛膜癌（choriocarcinoma）
C. 內胚層竇瘤（endodermal sinus tumor）
D. 成熟性畸胎瘤（mature teratoma）

正確答案：C. 內胚層竇瘤（endodermal sinus tumor）